下列關於 Bacillus anthracis 感染的敘述，何者錯誤？
A. 經由皮膚感染是人類最罕見的傳染方式
B. 在草食性動物最常見的感染途徑是食入孢子
C. 吸入性傳染是在畜牧業從業人員常見的感染途徑
D. 生化武器攻擊最常用的是吸入性的感染途徑

正確答案：A. 經由皮膚感染是人類最罕見的傳染方式